Earlier participation in a clinical study performed with cis-UCA

The above is a clinical trial exclusion criterion. Annotated with entity spans:
[Non-query-able: Earlier participation in a clinical study performed with cis-UCA]